kidney failure (creatinin > 2 g/dl, creatinin <clearance 30 ml/h) and/or hepatic failure (cholinesterase < 2000 UI);

The above is a clinical trial exclusion criterion. Annotated with entity spans:
[Condition: kidney failure] ([Measurement: creatinin] [Value: > 2 g/dl], [Measurement: creatinin <clearance] [Value: 30 ml/h]) and/or [Condition: hepatic failure] ([Measurement: cholinesterase] [Value: < 2000 UI]);